Which is the target of belimumab in Systemic Lupus Erythematosus treatment?

Belimumab is an anti-BAFF monoclonal antibody. BAFF is also known as BLyS (B-lymphocyte stimulator).